Patients' age less than 65 years;

The above is a clinical trial exclusion criterion. Annotated with entity spans:
Patients' [Person: age] [Value: less than 65 years];